Clinical trial exclusion criterion:
Females of childbearing potential who are not using adequate contraceptive methods (as required by local law or practice)

Annotated entities:
- Pregnancy_considerations: "Females of childbearing potential who are not using adequate contraceptive methods (as required by local law or practice)"